Clinical trial inclusion criterion:
sex in last 6 months with an HIV-infected partner

Entity relations:
- AND("sex", "HIV-infected partner")
- Has_temporal("sex", "in last 6 months")